Clinical trial exclusion criterion:
Pregnancy (positive B-HCG test performed a maxima 72h before) or breastfeeding

Entity relations:
- Has_value("B-HCG test", "positive")
- AND("Pregnancy", "B-HCG test")
- Has_temporal("B-HCG test", "a maxima 72h before")
- OR("Pregnancy", "breastfeeding")